Clinical trial exclusion criterion:
Use of antihistamine within the past 72 hours

Annotated entities:
- Drug: "antihistamine"
- Temporal: "within the past 72 hours"